Clinical trial exclusion criterion:
Has a history of lymphoproliferative disease

Annotated entities:
- Condition: "lymphoproliferative disease"